Clinical trial exclusion criterion:
Hypersensitivity on Colchicine

Entity relations:
- AND("Hypersensitivity", "Colchicine")